Able to complete full ankle flexion-extension bilaterally

The above is a clinical trial inclusion criterion. Annotated with entity spans:
[Mood: Able to] [Procedure: complete full ankle flexion-extension bilaterally]